Has access to transportation to visit the blood collection facility and to return to Stony Brook for all study visits.

The above is a clinical trial inclusion criterion. Annotated with entity spans:
[Non-query-able: Has access to transportation to visit the blood collection facility and to return to Stony Brook for all study visits.]